Known Immunoglobulin E (IgE)-mediated hypersensitivity to eggs manifested as hives, swelling of the mouth and throat, difficulty in breathing, hypotension, or shock

The above is a clinical trial exclusion criterion. Annotated with entity spans:
Known [Condition: Immunoglobulin E (IgE)-mediated hypersensitivity] to [Drug: eggs] manifested as [Condition: hives], [Condition: swelling of the mouth] and throat, [Condition: difficulty in breathing], [Condition: hypotension], or [Condition: shock]